Which database is available for the identification of chorion proteins in Lepidopteran proteomes?

LepChorionDB